下列何者不是人類幼裂絛蟲症（sparganosis）的感染途徑？
A. 喝入的飲水含有已感染寄生蟲之水蚤
B. 生食已感染寄生蟲之蛙肉或蛇肉
C. 將已感染寄生蟲之蛙肉或蛇肉敷在傷口
D. 生食已感染寄生蟲之魚肉

正確答案：D. 生食已感染寄生蟲之魚肉